pregnant

The above is a clinical trial exclusion criterion. Annotated with entity spans:
[Condition: pregnant]